Señale la respuesta correcta. Las sales de litio se utilizan para tratar:
1. Los síntomas afectivos de la esquizofrenia.
2. Los síntomas psicóticos de la esquizofrenia.
3. Como tratamiento de mantenimiento de pacientes bipolares con historia de manía.
4. Los episodios depresivos del trastorno bipolar, pero no los episodios maníacos.
5. En un fármaco en desuso y no recomendado en las actuales guías clínicas.

Respuesta correcta: 3. Como tratamiento de mantenimiento de pacientes bipolares con historia de manía.